Clinical trial exclusion criteria:
Age younger than 18 yrs. or older than 75 yrs.
Pregnancy or nursing (negative pregnancy blood test)
History of allergic reactions to phenylephrine or ephedrine
eGFR < 60ml/min/1.73m2

Annotated entities:
- Person: "Age"
- Value: "younger than 18 yrs. or older than 75 yrs."
- Condition: "Pregnancy"
- Condition: "nursing"
- Value: "negative"
- Measurement: "pregnancy blood test"
- Temporal: "History"
- Condition: "allergic reactions"
- Drug: "phenylephrine"
- Drug: "ephedrine"
- Measurement: "eGFR"
- Value: "< 60ml/min/1.73m2"